Clinical trial inclusion criterion:
Symptomatic GSV or SSV vein reflux > 0.5 seconds on colour Duplex

Annotated entities:
- Condition: "GSV vein reflux"
- Condition: "SSV vein reflux"
- Qualifier: "> 0.5 seconds"
- Procedure: "colour Duplex"